Clinical trial exclusion criterion:
Patients with chronic infection with Hepatitis B virus (HBV) and / or active infection with Hepatitis C virus (positive PCR result) at the time of transplant.

Entity relations:
- Has_value("PCR result", "positive")
- Has_qualifier("Hepatitis B virus (HBV)", "chronic")
- Has_qualifier("Hepatitis C virus", "active")
- Subsumes("Hepatitis B virus (HBV)", "PCR result")
- Has_temporal("Hepatitis B virus (HBV)", "at the time of transplant")
- OR("Hepatitis B virus (HBV)", "Hepatitis C virus")